Clinical trial exclusion criterion:
1. Have dementia or delirium (as determined by the palliative care specialist) at study entry.

Annotated entities:
- Condition: "dementia"
- Condition: "delirium"
- Temporal: "at study entry"